早產兒發生呼吸暫停（apnea）可分成中樞、阻塞以及混合型。對於阻塞型呼吸暫停，下列那一種治療最適宜？
A. 給與輸血
B. 給與氧氣
C. 給與 methylxanthines
D. 給與連續性氣道正壓（continuous positive airway pressure）

正確答案：D. 給與連續性氣道正壓（continuous positive airway pressure）